Clinical trial exclusion criterion:
History of hypersensitivity or allergy to any of the study drugs, drugs of similar chemical classes, ACE inhibitors (ACEIs), angiotensin II receptor blockers (ARBs), or neprilysin inhibitors, as well as known or suspected contraindications to the study drugs.

Entity relations:
- Has_mood("contraindications", "known")
- AND("contraindications", "study drugs")
- AND("hypersensitivity", "study drugs")
- OR("known", "suspected")
- OR("study drugs", "angiotensin II receptor blockers (ARBs)", "ACE inhibitors (ACEIs)", "neprilysin inhibitors")
- OR("hypersensitivity", "allergy")
- OR("hypersensitivity", "contraindications")